Known diagnosis of moderate or malignant retinopathy (including retinal hemorrhage, visual disturbance and retinal microaneurysm within 6 months)

The above is a clinical trial exclusion criterion. Annotated with entity spans:
Known diagnosis of [Qualifier: moderate] or [Qualifier: malignant] [Condition: retinopathy] (including [Condition: retinal hemorrhage], [Condition: visual disturbance] and [Condition: retinal microaneurysm] [Temporal: within 6 months])